Clinical trial exclusion criterion:
Person is under 18 years of age.

Annotated entities:
- Person: "age"
- Value: "under 18 years"